Clinical trial exclusion criteria:
1. Patients with C class by child-pugh score
2. Patients in the acute phase of severe hepatitis
3. Patients have been diagnosed with cancer of the liver
4. Patients with severe cardiopulmonary cerebral disease, and in the failure state
5. Patients in Highly allergic constitution
6. Patients with moderately severe mental disease

Annotated entities:
- Measurement: "child-pugh score"
- Value: "C class"
- Condition: "severe hepatitis"
- Qualifier: "acute phase"
- Condition: "cancer of the liver"
- Condition: "cardiopulmonary cerebral disease"
- Qualifier: "severe"
- Condition: "Highly allergic constitution"
- Condition: "mental disease"
- Qualifier: "moderately severe"
- Undefined_semantics: "mental disease"